Clinical trial exclusion criterion:
The score of HAMD =21

Annotated entities:
- Measurement: "score of HAMD"
- Value: "=21"